What is the function of the DGAT1 gene product?

diacylglycerol acyltransferase 1 (dgat1) catalyzes the final step in the acyl-coa-dependent triacylglycerol biosynthesis.